Clinical trial inclusion criterion:
Uncomplicated RYGB performed minimum 3 months prior to the study.

Annotated entities:
- Qualifier: "Uncomplicated"
- Procedure: "RYGB"
- Temporal: "minimum 3 months prior to the study"
- Reference_point: "the study"